Clinical trial inclusion criterion:
Intrauterine fetal death as confirmed by absence of cardiac motion on ultrasound by Attending physician at the time of admission to the hospital.

Annotated entities:
- Condition: "Intrauterine fetal death"
- Condition: "absence of cardiac motion"
- Procedure: "ultrasound"
- Temporal: "at the time of admission to the hospital"
- Reference_point: "admission to the hospital"